張小姐 26 歲，原本就有近視散光，原來的眼鏡已經戴了 4 年，最近覺得看東西模糊，所以到眼鏡行想重配眼鏡。老闆告知眼睛有問題，所以至眼科檢查，發現張小姐的度數和原來的眼鏡比較，右眼近視增加-2.0D，散光增加 5.0D，矯正視力為 6/20，左眼散光增加 2.0D，矯正視力為 6/6.7，裂隙燈及視網膜檢查皆正常。張小姐工作為室內設計，下列何項治療為優先選擇？
A. 戴針孔眼鏡
B. 戴軟式日拋隱形眼鏡
C. 戴硬式透氧隱形眼鏡
D. 近視及散光雷射手術

正確答案：C. 戴硬式透氧隱形眼鏡